腎臟癌可進行部分腎切除（partial nephrectomy）者，其腫瘤大小一般設定在多大範圍以內，請選擇最適當的答案？
A. 2 公分以下
B. 4 公分以下
C. 6 公分以下
D. 8 公分以下

正確答案：B. 4 公分以下